Vaccination within 30 days prior to the first dose administration or has plans to receive a vaccination during the course of the study (including the follow phone call on Day 105).

The above is a clinical trial exclusion criterion. Annotated with entity spans:
[Procedure: Vaccination] [Temporal: within 30 days prior] to [Reference_point: the first dose administration] or has [Mood: plans] to receive a [Procedure: vaccination] [Temporal: during the course] of the [Reference_point: study] (including the follow phone call on Day 105).